Clinical trial inclusion criterion:
Adult patient (male or female) requiring emergency endotracheal intubation.

Annotated entities:
- Person: "Adult"
- Person: "male"
- Person: "female"
- Procedure: "emergency endotracheal intubation"